Hepatic abnormalities;

The above is a clinical trial exclusion criterion. Annotated with entity spans:
[Condition: Hepatic abnormalities];